Clinical trial exclusion criterion:
Child unwilling to agree to second insulin injection at a meal-time

Annotated entities:
- Post-eligibility: "Child unwilling to agree to second insulin injection at a meal-time"